28歲G3P1孕婦，第一胎曾經被診斷為妊娠糖尿病（gestational diabetes mellitus, GDM），胎兒出生體重為 4,280公克；求診時為妊娠12週，體重50 kg，身高163 cm。此次懷孕對於妊娠血糖評估的最適當處置為：
A. 等同於妊娠糖尿病，立即採取治療方案
B. 立即安排妊娠糖尿病篩檢
C. 安排於妊娠24～28週常規妊娠糖尿病篩檢
D. 立即安排胎兒的健康評估

正確答案：B. 立即安排妊娠糖尿病篩檢